Clinical trial inclusion criterion:
Male and/or female healthy volunteers, age 18 to 55 years. Females must be of non-childbearing potential.

Entity relations:
- Has_value("age", "18 to 55 years")
- Has_negation("childbearing potential", "non")
- OR("Male", "female")